Clinical trial inclusion criterion:
Modified Allen or Barbeau test should be positive (presence of collateral palmar flow).

Entity relations:
- Has_value("Modified Allen test", "positive")
- Has_qualifier("collateral palmar flow", "presence")
- OR("Modified Allen test", "Barbeau test")